Clinical trial exclusion criterion:
type 1 diabetic or non-diabetic

Entity relations:
- OR("type 1 diabetic", "non-diabetic")